下列有關腺嘌呤核苷酸易位酶（adenine nucleotide translocase）之敘述，何者為真？
A. 位於粒線體的外膜
B. 主要媒介 ATP 與 ADP 穿過粒線體內膜的互換反應
C. 主要媒介 ATP 由粒線體膜外運送至間質（matrix）
D. 主要媒介 ADP 由間質穿過粒線體內膜轉運至膜間空隙（intermembrane space）

正確答案：B. 主要媒介 ATP 與 ADP 穿過粒線體內膜的互換反應